Clinical trial inclusion criterion:
(1) intrauterine device in place for at least 3 months prior to the start of the study and remaining in place during the study period, or (2) barrier methods containing or used in conjunction with a spermicidal agent, or (3) postmenopausal accompanied with a documented postmenopausal course of at least one year or surgical sterility (tubal ligation, oophorectomy or hysterectomy).

Annotated entities:
- Device: "intrauterine device"
- Temporal: "for at least 3 months prior to the start of the study"
- Reference_point: "the start of the study"
- Temporal: "in place during the study period"
- Reference_point: "the study period"
- Procedure: "barrier methods"
- Drug: "spermicidal agent"
- Condition: "postmenopausal"
- Temporal: "at least one year"
- Condition: "surgical sterility"
- Procedure: "tubal ligation"
- Procedure: "oophorectomy"
- Procedure: "hysterectomy"